What body process does the Dentate Gyrus Mossy Cell control?

Dentate gyrus mossy cells control spontaneous convulsive seizures and cognition